Clinical suspicion of Morton neuroma confirmed in ultrasound scan

The above is a clinical trial inclusion criterion. Annotated with entity spans:
[Mood: Clinical suspicion] of [Condition: Morton neuroma] confirmed in [Procedure: ultrasound scan]